Clinical trial exclusion criterion:
Previous recruitment into the trial

Annotated entities:
- Competing_trial: "Previous recruitment into the trial"